有關白色糠疹（pityriasis alba）的敘述，下列何者錯誤？
A. 出現白色脫屑斑
B. 常見於臉上
C. 好發於小孩
D. 患者即使成年後，多數病變仍不易痊癒

正確答案：D. 患者即使成年後，多數病變仍不易痊癒